Clinical trial exclusion criterion:
Patients with severe heart disease history, including ventricular tachycardia (VT), atrial fibrillation (AF), heart block, myocardial infarction (MI), congestive heart failure (CHF), coronary heart disease patients needed therapy;

Annotated entities:
- Condition: "heart disease"
- Qualifier: "severe"
- Condition: "ventricular tachycardia"
- Condition: "VT"
- Condition: "atrial fibrillation"
- Condition: "AF"
- Condition: "heart block"
- Condition: "myocardial infarction"
- Condition: "MI"
- Condition: "congestive heart failure"
- Condition: "CHF"
- Condition: "coronary heart disease"